有關急性細菌性副睪丸炎之敘述，下列何者錯誤？
A. 如果細菌培養結果顯示與性傳染病有關，最好其性伴侶也要治療，以免重複感染（re-infection）
B. 反覆發生的副睪丸炎及疼痛，可以考慮副睪丸及睪丸切除術，不能只切除副睪丸
C. 急性期時尿中及血液中之白血球常會上升
D. 除非發生明顯全身性症狀（constitutional symptoms），如發燒、寒顫或	血症，一般來說，口服抗生素就足夠

正確答案：B. 反覆發生的副睪丸炎及疼痛，可以考慮副睪丸及睪丸切除術，不能只切除副睪丸